Clinical trial inclusion criterion:
Fasting blood glucose 100-125 mg/dL

Annotated entities:
- Measurement: "Fasting blood glucose"
- Value: "100-125 mg/dL"